Clinical trial exclusion criteria:
Intolerability of tamsulosin or related drugs
Investigator discretion
Unwillingness or inability to comply with protocol procedures and assessments

Annotated entities:
- Condition: "Intolerability"
- Drug: "tamsulosin"
- Drug: "related drugs"
- Non-query-able: "Investigator discretion"
- Informed_consent: "Unwillingness or inability to comply with protocol procedures and assessments"